一位兒童會使用湯匙吃飯，會脫襪子，但不會使用筷子，不會關水龍頭，不會解開扣子，其最可能之年齡為何？
A. 2 歲
B. 3 歲半
C. 4 歲半
D. 6 歲

正確答案：A. 2 歲